Clinical trial exclusion criterion:
8. Patients with Grade 3 hyperbilirubinemia

Entity relations:
- Has_qualifier("hyperbilirubinemia", "Grade 3")